ongoing antibiotic treatment at the day of inclusion

The above is a clinical trial exclusion criterion. Annotated with entity spans:
ongoing [Drug: antibiotic] [Procedure: treatment] [Temporal: at the day of inclusion]